Clinical trial exclusion criterion:
End stage renal disease or on dialysis

Entity relations:
- OR("End stage renal disease", "dialysis")